Clinical trial exclusion criterion:
Patients receiving psychotropics of any kind, including betablockers and other anticonvulsants. Sleep medication such as oral chloral-hydrate or zopiclone are acceptable.

Entity relations:
- Subsumes("psychotropics", "betablockers")
- Has_qualifier("chloral-hydrate", "oral")
- Subsumes("Sleep medication", "chloral-hydrate")
- Has_negation("Sleep medication", "acceptable")
- OR("betablockers", "anticonvulsants")
- OR("chloral-hydrate", "zopiclone")